Use of alternative therapies or natural products to treat postmenopausal symptoms in the four weeks prior to randomization.

The above is a clinical trial exclusion criterion. Annotated with entity spans:
Use of [Procedure: alternative therapies] or [Drug: natural products] to treat [Condition: postmenopausal symptoms] [Temporal: in the four weeks prior to randomization].